脈絡膜先天性缺損（coloboma of the uveal tract）通常發生在眼球的幾點鐘部位？
A. 3點鐘
B. 6點鐘
C. 9點鐘
D. 12點鐘

正確答案：B. 6點鐘